新生兒缺乏下列何種細胞膜蛋白最容易引起嚴重下痢？
A. sodium-dependent glucose transporter 1（SGLT1）
B. cystic fibrosis transmembrane conductance regulator（CFTR）
C. aquaporin
D. sodium-dependent glucose transporter 2（SGLT 2）

正確答案：A. sodium-dependent glucose transporter 1（SGLT1）